Clinical trial inclusion criterion:
2. Sex: Male and non-pregnant, non-lactating female

Annotated entities:
- Person: "Male"
- Condition: "pregnant"
- Negation: "non"
- Negation: "non"
- Condition: "lactating"
- Person: "female"